下列何種量表最常被用來評估老人之認知功能（cognitive function）？
A. Barthel Index
B. Geriatric Depression Scale
C. Katz Index
D. Mini-Mental State Examination

正確答案：D. Mini-Mental State Examination